Clinical trial exclusion criterion:
Surgery and/or previous ocular pathology (presence of scar/change in the cornea, glaucoma, retinopathies, etc.).

Annotated entities:
- Procedure: "Surgery"
- Condition: "ocular pathology"
- Temporal: "previous"
- Condition: "scar"
- Observation: "change in the cornea"
- Condition: "glaucoma"
- Condition: "retinopathies"